Clinical trial exclusion criterion:
Patients with sick sinus syndrome (SSS) or high degree AV block without pacemaker protection

Entity relations:
- Has_qualifier("AV block", "high degree")
- Has_negation("pacemaker", "without")
- AND("AV block", "pacemaker")
- Subsumes("sick sinus syndrome", "SSS")
- OR("sick sinus syndrome", "AV block")